Clinical trial inclusion criterion:
Study eye with clinically significant diabetic macular edema (DME) with central subfield thickness ≥ 350µm on spectral domain OCT

Entity relations:
- Has_qualifier("diabetic macular edema (DME)", "clinically significant")
- AND("spectral domain OCT", "central subfield thickness")
- Has_value("central subfield thickness", "≥ 350µm")
- AND("diabetic macular edema (DME)", "spectral domain OCT")